Clinical trial inclusion criterion:
6. Are not currently taking melatonin.

Annotated entities:
- Drug: "melatonin"
- Temporal: "currently"
- Negation: "not"